35 歲男性因雙側慢性鼻竇炎併鼻息肉，於醫院接受雙側功能性鼻竇內視鏡手術，術後第三日病人由鼻部流出清澈液體，並出現發燒、暈眩、劇烈頭痛、頸部僵硬之症狀。最可能為下列何種診斷？
A. 眼球氣腫（orbital emphysema）
B. 腦脊髓液漏出（CSF leak）
C. 眼球血腫（orbital hematoma）
D. 溢淚（epiphora）

正確答案：B. 腦脊髓液漏出（CSF leak）